stroke

The above is a clinical trial inclusion criterion. Annotated with entity spans:
[Condition: stroke]